What is the target of adalimumab?

Adalimumab is a fully human anti-TNF-alpha IgG1-κ monoclonal antibody.